一位18歲單身女性，有氣喘病史，右腎萎縮但腎功能正常。兩天前有上腹間歇性疼痛，有時伴有腹脹。她並不在意，但昨天忽然覺得右下腹疼痛，且有加劇的現象。她來到急診室，當時胃口不佳，但無噁心或嘔吐。血壓107/71 mmHg，體溫 8 oC，脈搏74下/min，呼吸 20 次/min。白血球：13000/ mm3，血色素：12.5 g/dL，血小板：259 × 103 /mm3。最可能的診斷為何？
A. 泌尿道結石
B. 急性闌尾炎
C. 子宮外孕
D. 骨盆腔發炎

正確答案：B. 急性闌尾炎